Clinical trial exclusion criterion:
contraindications to epidural analgesia

Annotated entities:
- Condition: "contraindications"
- Procedure: "epidural analgesia"